Informed consent

The above is a clinical trial inclusion criterion. Annotated with entity spans:
[Informed_consent: Informed consent]